Fasting glucose greater 150 mg/dL.

The above is a clinical trial exclusion criterion. Annotated with entity spans:
[Measurement: Fasting glucose] [Value: greater 150 mg/dL].